Clinical trial exclusion criterion:
Receiving drugs acting primarily on the central nervous system, which lower the seizure threshold (see appendix 2)

Annotated entities:
- Drug: "drugs acting primarily on the central nervous system"
- Qualifier: "lower the seizure threshold"